Normal weight as defined by a Body Mass Index (BMI, weight in kg divided by the square of height in meters) of 18.0 to 30.0 kg/m2, extremes included

The above is a clinical trial inclusion criterion. Annotated with entity spans:
[Condition: Normal weight] as defined by a [Measurement: Body Mass Index] ([Measurement: BMI], [Measurement: weight in kg divided by the square of height in meters]) of [Value: 18.0 to 30.0 kg/m2, extremes included]